Clinical trial exclusion criterion:
Evidence of an active gastrointestinal or urogenital bleeding

Annotated entities:
- Condition: "gastrointestinal bleeding"
- Condition: "urogenital bleeding"
- Temporal: "active"